Clinical trial exclusion criterion:
Patients on a legal protection regime type guardianship

Annotated entities:
- Person: "legal protection regime type guardianship"